Clinical trial inclusion criterion:
Male or female term baby with gestational >37 weeks and postnatal age < or= 28 days

Annotated entities:
- Person: "Male"
- Person: "female"
- Condition: "term"
- Person: "baby"
- Measurement: "gestational"
- Value: ">37 weeks"
- Measurement: "postnatal age"
- Value: "< or= 28 days"